Clinical trial inclusion criterion:
Female subjects aged =/> 18 years and of reproductive age.

Entity relations:
- Has_value("aged", "=/> 18 years")